Allergy or contraindication to paracetamol, Prasugrel or Ticagrelor

The above is a clinical trial exclusion criterion. Annotated with entity spans:
[Condition: Allergy] or [Condition: contraindication] to [Drug: paracetamol], [Drug: Prasugrel] or [Drug: Ticagrelor]